一位55歲男性患有肺癌及全身骨轉移，已使用高量嗎啡，病人仍感受無法忍受的不適，要求醫師讓他睡	就好了，下列那一項是不當的敘述？
A. 使用更高量的嗎啡止痛
B. 給予足量的鎮靜劑協助病人入睡
C. 給予鎮靜劑或止痛劑可能會影響病人的呼吸
D. 若給予藥物後病人可能會死亡，等於是給病人安樂死，故不宜再給藥

正確答案：D. 若給予藥物後病人可能會死亡，等於是給病人安樂死，故不宜再給藥